Have one of the following disease histories:

The above is a clinical trial inclusion criterion. Annotated with entity spans:
[Parsing_Error: Have one of the following disease histories:]